Clinical trial exclusion criterion:
Pregnancy, breast-feeding.

Annotated entities:
- Condition: "Pregnancy"
- Observation: "breast-feeding"